13. HIV medications: efavirenz, etravirine, all ritonavir boosted and unboosted HIV protease inhibitors

The above is a clinical trial exclusion criterion. Annotated with entity spans:
[Parsing_Error: 13.] HIV medications: [Drug: efavirenz], [Drug: etravirine], all [Qualifier: ritonavir boosted] [Grammar_Error: and] unboosted [Drug: HIV protease inhibitors]